下列何種藥物使用時，可以明顯的改善甲狀腺機能亢進的臨床症狀，但不會降低血清中甲狀腺素濃度？
A. Levothyroxine
B. Methimazole
C. Propranolol
D. Propylthiouracil

正確答案：C. Propranolol